Hypersensitivity to ticagrelor

The above is a clinical trial exclusion criterion. Annotated with entity spans:
[Condition: Hypersensitivity] to [Drug: ticagrelor]